直腸癌接受 total mesorectal excision 之治療不會有下列那一項結果？
A. 性無能的發生機率會增高
B. 病患長期預後較佳
C. 局部復發率會減少
D. 膀胱功能異常會減少

正確答案：A. 性無能的發生機率會增高